Clinical trial inclusion criterion:
Patient with a CHADS2VASC score =2

Annotated entities:
- Measurement: "CHADS2VASC score"
- Value: "=2"